The group of patients who participated in the study included adults aged at least 19 years among the atraumatic CA outpatients who came to the ER and received CPR.

The above is a clinical trial inclusion criterion. Annotated with entity spans:
The group of patients who participated in the study included [Person: adults] [Person: aged] [Value: at least 19 years] among the [Condition: atraumatic CA] [Visit: outpatients] who came to the [Visit: ER] and received [Procedure: CPR].